Clinical trial exclusion criterion:
Patients with sepsis.

Annotated entities:
- Condition: "sepsis"